Indication of kidney transplantation

The above is a clinical trial inclusion criterion. Annotated with entity spans:
[Mood: Indication] of [Procedure: kidney transplantation]